Clinical trial inclusion criterion:
Any patient age 4-16 years with sickle cell disease who presents the Pediatric ER with acute sickle cell pain crisis with a pain of 6/10 or higher

Entity relations:
- Has_value("pain", "6/10 or higher")
- Has_value("age", "4-16 years")